Clinical trial inclusion criterion:
Women of child bearing potential must test negative on standard pregnancy test (urine or serum)

Annotated entities:
- Person: "Women"
- Condition: "child bearing potential"
- Measurement: "standard pregnancy test"
- Value: "negative"
- Measurement: "urine"
- Measurement: "serum"